Clinical trial exclusion criterion:
Patients who were pregnant, nursing or not able to give written informed consent were excluded.

Entity relations:
- Has_negation("able to give written informed consent", "not")
- Has_context("nursing", "able to give written informed consent")
- OR("pregnant", "nursing")